Total bilirubin > 3 mg/dL.

The above is a clinical trial exclusion criterion. Annotated with entity spans:
[Measurement: Total bilirubin] [Value: > 3 mg/dL].